Clinical trial inclusion criterion:
Ovarian, endometrial or cervical - Gynecologic Oncology Group (GOG) performance score ≤2

Entity relations:
- Has_value("Gynecologic Oncology Group (GOG) performance score", "≤2")
- Has_qualifier("Gynecologic Oncology Group (GOG) performance score", "Ovarian")
- OR("Ovarian", "cervical", "endometrial")